Clinical trial exclusion criterion:
Creatinine clearance (estimated by Cockcroft-Gault) <30 ml / min.

Annotated entities:
- Measurement: "Creatinine clearance"
- Qualifier: "Cockcroft-Gault"
- Value: "<30 ml / min"